Clinical trial exclusion criterion:
known pregnancy

Annotated entities:
- Condition: "pregnancy"